Previous serious adverse event or hypersensitivity to cannabis or cannabinoids

The above is a clinical trial exclusion criterion. Annotated with entity spans:
Previous [Qualifier: serious] [Condition: adverse event] or [Condition: hypersensitivity] to [Drug: cannabis] or [Drug: cannabinoids]